Clinical trial exclusion criterion:
presence of fistula or abscess near the selected tooth

Entity relations:
- Has_qualifier("fistula", "near the selected tooth")
- OR("fistula", "abscess")